以下何者並非醫學倫理四大原則中之一項：
A. 尊重病人自主權（autonomy）
B. 效率原則（efficiency）
C. 不 加害原則（nonmaleficence）
D. 公平正義原則（justice）

正確答案：B. 效率原則（efficiency）